下列何者為興奮膀胱頸內括約肌的主要神經？
A. 交感神經
B. 迷走神經
C. 陰部神經
D. 骨盆內臟神經

正確答案：A. 交感神經